腳趾的內收及外展動作以下列何者為其軸心？
A. 腳趾
B. 第二趾
C. 第三趾
D. 第四趾

正確答案：B. 第二趾